下列何者是小兒麻痺後症候群（post-polio syndrome）最可能的病因？
A. 身體過度活動使用
B. 小兒麻痺病毒再活性化
C. 為運動神經元疾病（motor neuron disease）之變種
D. 為神經中毒所造成

正確答案：A. 身體過度活動使用